Clinical trial exclusion criterion:
left-handed;

Annotated entities:
- Condition: "left-handed"